Clinical trial inclusion criterion:
Serum glutamic oxaloacetic transaminase (SGOT) and serum glutamate pyruvate transaminase (SGPT) < 2.5 x upper limit of normal for patients without liver metastases OR SGOT and SGPT < 5 x upper limit of normal for patients with liver metastases

Annotated entities:
- Measurement: "Serum glutamic oxaloacetic transaminase"
- Measurement: "SGOT"
- Measurement: "serum glutamate pyruvate transaminase"
- Measurement: "SGPT"
- Value: "< 2.5 x upper limit of normal"
- Negation: "without"
- Condition: "liver metastases"
- Measurement: "SGOT"
- Measurement: "SGPT"
- Value: "< 5 x upper limit of normal"
- Condition: "liver metastases"